Clinical trial inclusion criterion:
1. Individuals scheduled for undergoing colonoscopy at the Endoscopy Center of Wuxi people's Hospital in China

Entity relations:
- AND("colonoscopy", "scheduled for undergoing")
- AND("colonoscopy", "Endoscopy Center of Wuxi people's Hospital in China")